Clinical trial exclusion criterion:
Persons referred to in Articles L1121-5 to L1121-8 of the French Public health Code: pregnant woman, parturient, nursing mother, person deprived of liberty by judicial or administrative decision, person subject to a legal protection measure, can not Be included in clinical trials.

Entity relations:
- AND("woman", "pregnant")
- Subsumes("Persons referred to in Articles L1121-5 to L1121-8 of the French Public health Code", "woman")
- OR("pregnant", "nursing", "parturient", "deprived of liberty")